American Society of Anesthesiologists Classification I-III

The above is a clinical trial inclusion criterion. Annotated with entity spans:
[Measurement: American Society of Anesthesiologists Classification] [Value: I-III]